Hepatic encephalopathy

The above is a clinical trial exclusion criterion. Annotated with entity spans:
[Condition: Hepatic encephalopathy]